下列何者不可作為處方心臟病患者運動時運動強度的指標？
A. 血氧濃度
B. 最大心跳率的百分比
C. 運動自覺量表
D. 代謝當量（MET）

正確答案：A. 血氧濃度